¿En qué trastorno el individuo trasgrede las normas sociales establecidas, a través de comportamientos fraudulentos o ilegales, a pesas de que conoce bien el sentido moral y legal de sus acciones pero no las pone en práctica?:
1. El trastorno delirante.
2. El síndrome de Kleine- Levin.
3. El trastorno de déficit de atención con hiperactividad.
4. El trastorno de personalidad antisocial.
5. El trastorno bipolar tipo II.

Respuesta correcta: 4. El trastorno de personalidad antisocial.